Which is the main target of the anti-arrhythmic activity of flecainide?

Flecainide is a class 1c antiarrhythmic that acts by blocking sodium channels and is used mainly in the treatment of supraventricular arrhythmias.